En 1916, en la Casa de Salud de Santa Cristina en Madrid, se aprobó el Reglamento para la primera:
1. Escuela de Matronas de España.
2. Escuela de Enfermeras Militares.
3. Real Cédula de Ministrantes.
4. Colegiatura de Cirujanos y Sangradores.
5. Junta de Patronato de Formación de Enfermeras.

Respuesta correcta: 1. Escuela de Matronas de España.